A una mujer de 52 años le detectan en una mamografía un nódulo y se le aconseja hacer una biopsia mediante punción con control ecográfico. La paciente le pregunta a Vd. sobre la probabilidad de tener cáncer si la prueba sale positiva. Como Vd no tiene experiencia en este tema busca y encuentra un estudio que incluye a 112 pacientes, 18 con cáncer y 94 sin cáncer. De los 18 pacientes con cáncer la punción dio un resultado positivo en 16 y de los 94 pacientes sin cáncer la punción dio un resultado negativo en 88. Con estos datos la la respuesta correcta es:
1. 0,727.
2. 0,93.
3. 0,645.
4. 0,56.
5. No puede calcularse porque no se conoce la prevalencia de la enfermedad.

Respuesta correcta: 1. 0,727.